Clinical trial inclusion criterion:
The patient receive no anti-cancer treatment before primary surgery.

Annotated entities:
- Drug: "anti-cancer treatment"
- Negation: "no"
- Temporal: "before primary surgery"
- Procedure: "primary surgery"
- Reference_point: "primary surgery"